Clinical trial exclusion criterion:
Placement of an intrauterine device (IUD) or intrauterine system (IUS)

Entity relations:
- Subsumes("intrauterine device", "IUD")
- Subsumes("intrauterine system", "IUS")
- OR("intrauterine device", "intrauterine system")